Clinical trial exclusion criterion:
Oliguria (urine output less than 400 ml per day)

Annotated entities:
- Condition: "Oliguria"
- Measurement: "urine output"
- Value: "less than 400 ml per day"